Clinical trial exclusion criteria:
Cases of rectal tumours below 12cm from anal verge, or locally advanced tumours invading blood vessels, nerves or bone.
Multiple bone metastasis or central nervous system metastasis
Other neoplastic disease in the 5 previous years, except squamous or basal cell skin carcinoma or cervical "in situ" carcinoma
Significant heart disease (chronic congestive heart failure, symptomatic coronary disease) or myocardial infarction in the previous 6 months
Peripheral neuropathy
Patients who do not give informed consent

Annotated entities:
- Condition: "rectal tumours"
- Qualifier: "below 12cm from anal verge"
- Condition: "locally advanced tumours"
- Condition: "invading blood vessels"
- Condition: "nerves invading"
- Condition: "bone invading"
- Condition: "Multiple bone metastasis"
- Condition: "central nervous system metastasis"
- Condition: "neoplastic disease"
- Qualifier: "Other"
- Temporal: "in the 5 previous years"
- Condition: "basal cell skin carcinoma"
- Condition: "squamous cell skin carcinoma"
- Condition: "cervical "in situ" carcinoma"
- Negation: "except"
- Condition: "heart disease"
- Qualifier: "Significant"
- Condition: "chronic congestive heart failure"
- Condition: "symptomatic coronary disease"
- Condition: "myocardial infarction"
- Temporal: "in the previous 6 months"
- Condition: "Peripheral neuropathy"
- Non-query-able: "Patients who do not give informed consent"